關於C型肝炎的自然病史，下列何者錯誤？
A. 慢性C型肝炎經過20～30年後，約有20～25%的帶原者會發展成肝硬化
B. 肝硬化患者每年有1～4%罹患肝細胞癌
C. 慢性C型肝炎是西方國家肝臟移植最主要的適應症之一
D. 女性、	酒、以及30歲以上的感染是慢性C型肝炎快速進展之重要因素

正確答案：D. 女性、	酒、以及30歲以上的感染是慢性C型肝炎快速進展之重要因素